Clinical trial exclusion criterion:
Skin and perineal disease with risk of infection

Entity relations:
- OR("Skin disease", "perineal disease")